Clinical trial exclusion criterion:
Concomitant administration of strong inhibitors of P-glycoprotein like ketoconazole, cyclosporin, itraconazole or dronedarone

Annotated entities:
- Drug: "inhibitors of P-glycoprotein"
- Drug: "ketoconazole"
- Drug: "cyclosporin"
- Drug: "itraconazole"
- Drug: "dronedarone"